Clinical trial exclusion criterion:
Hypersensitivity to Sandostatin or any component of the formulation.

Annotated entities:
- Condition: "Hypersensitivity"
- Drug: "Sandostatin"
- Drug: "component of the formulation"